Las medidas de prevención primaria de infecciones de transmisión sexual, NO incluyen:
1. Realizar anamnesis desde los 12 años para identificar los comportamientos y prácticas sexuales de riesgo.
2. Fomentar el uso correcto y regular del preservativo masculino o femenino desde la primera relación sexual.
3. Desarrollar campañas de vacunación del VHB en grupos de riesgo como los usuarios de drogas por vía parenteral.
4. Realización de citologías frecuentes en mujeres sexualmente activas.
5. Redirigir los programas escolares de educación sexual, hacia una sexualidad saludable y responsable.

Respuesta correcta: 4. Realización de citologías frecuentes en mujeres sexualmente activas.